Clinical trial inclusion criterion:
Creatinine clearance (CrCl) greater than or equal to 60 mL/min, either measured or estimated by Cockcroft-Gault equation. NOTE: A calculator for estimating the CrCl can be found at www.fstrf.org/ACTG/ccc.html

Entity relations:
- Has_value("Creatinine clearance (CrCl)", "greater than or equal to 60 mL/min")
- AND("Creatinine clearance (CrCl)", "Cockcroft-Gault equation")